Clinical trial exclusion criterion:
secondary diabetes

Entity relations:
- Has_qualifier("diabetes", "secondary")